Immunization with any other vaccine (oral or parenteral) within 4 weeks prior to study start or planned vaccination during the study

The above is a clinical trial exclusion criterion. Annotated with entity spans:
[Procedure: Immunization with] [Qualifier: any other] vaccine ([Qualifier: oral] or [Qualifier: parenteral]) [Temporal: within 4 weeks prior to study start] or [Mood: planned] [Procedure: vaccination] [Temporal: during the study]